Clinical trial exclusion criterion:
Presence of any Axis I psychiatric disorder (other than unipolar major depression) or substance abuse;

Entity relations:
- Has_qualifier("psychiatric disorder", "Axis I")
- Has_negation("unipolar major depression", "other than")
- OR("psychiatric disorder", "substance abuse")
- OR("unipolar major depression", "substance abuse")